Clinical trial inclusion criterion:
Capable of giving written informed consent, which includes compliance with the requirements and restrictions listed in the consent form

Annotated entities:
- Non-query-able: "Capable of giving written informed consent, which includes compliance with the requirements and restrictions listed in the consent form"